Clinical trial exclusion criterion:
4. A woman who is pregnant, nursing an infant, or planning a pregnancy.

Entity relations:
- OR("pregnant", "nursing", "pregnancy")